For the RECAMP-MV trial: the child is enrolled in RECAMP-OPV

The above is a clinical trial exclusion criterion. Annotated with entity spans:
For the [Observation: RECAMP-MV trial]: the child is [Observation: enrolled in RECAMP-OPV]